Clinical trial inclusion criterion:
Development of pathological Q waves on ECG.

Annotated entities:
- Condition: "pathological Q waves"
- Procedure: "ECG"